La articulación humerocubital es un ejemplo de:
1. Articulación en silla de montar.
2. Articulación condílea.
3. Articulación en pivote (trocoide).
4. Articulación en bisagra (tróclea)
5. Artrodia.

Respuesta correcta: 4. Articulación en bisagra (tróclea)